3. Steroids less than 0.5 mg/kg/day prednisone

The above is a clinical trial inclusion criterion. Annotated with entity spans:
[Parsing_Error: 3.] [Drug: Steroids] [Multiplier: less than 0.5 mg/kg/day] [Drug: prednisone]